Clinical trial inclusion criterion:
Maximum one of the following SIRS criteria (* T>38 ºC or <36ºC, L>12,000 or <4000/uL, HR>90 bpm, RR<20 rpm) or CRP>15 mg/dL

Annotated entities:
- Measurement: "SIRS criteria"
- Measurement: "T"
- Value: ">38 ºC"
- Value: "<36ºC"
- Measurement: "L"
- Value: ">12,000 /uL"
- Value: "<4000/uL"
- Measurement: "HR"
- Value: ">90 bpm"
- Measurement: "RR"
- Value: "<20 rpm"
- Measurement: "CRP"
- Value: ">15 mg/dL"